Clinical trial inclusion criteria:
Has a HCC diagnosis confirmed by radiology, histology, or cytology (fibrolamellar, and mixed hepatocellular/cholangiocarcinoma subtypes are not eligible)
Has Barcelona Clinic Liver Cancer (BCLC) Stage C disease or BCLC Stage B disease not amenable to locoregional therapy or refractory to locoregional therapy and not amenable to a curative treatment approach
Has a Child-Pugh A liver score within 7 days prior to first dose of study medication
Has a life expectancy of >3 months
Has at least one measurable lesion based on RECIST version 1.1 as determined by investigator
Has Eastern Cooperative Oncology Group (ECOG) performance status of 0 or 1 performed within 7 days prior to receiving the first dose of study medication
Has documented objective radiographic progression during or after treatment with sorafenib or oxaliplatin-based chemotherapy, or else intolerance to sorafenib or oxaliplatin-based chemotherapy
Female participants of childbearing potential must have a negative urine or serum pregnancy test within 72 hours prior to receiving the first dose of study therapy
Female and male participants of reproductive potential must agree to use adequate contraception starting from the first dose of study medication, throughout the study period, and for up to 120 days after the last dose of study medication

Annotated entities:
- Condition: "HCC"
- Procedure: "radiology"
- Procedure: "histology"
- Procedure: "cytology"
- Condition: "subtype fibrolamellar"
- Condition: "mixed hepatocellular/cholangiocarcinoma subtype"
- Negation: "not eligible"
- Measurement: "Barcelona Clinic Liver Cancer (BCLC)"
- Value: "Stage C"
- Condition: "disease"
- Context_Error: "disease"
- Measurement: "BCLC"
- Value: "Stage B"
- Qualifier: "amenable to locoregional therapy"
- Qualifier: "refractory to locoregional therapy"
- Qualifier: "amenable to a curative treatment approach"
- Negation: "not"
- Negation: "not"
- Condition: "disease"
- Context_Error: "disease"
- Measurement: "Child-Pugh liver score"
- Value: "A"
- Temporal: "within 7 days prior"
- Reference_point: "first dose of study medication"
- Observation: "life expectancy"
- Value: ">3 months"
- Multiplier: "at least one"
- Condition: "lesion"
- Measurement: "RECIST version 1.1"
- Value: "measurable"
- Measurement: "Eastern Cooperative Oncology Group (ECOG) performance status"
- Value: "0 or 1"
- Temporal: "within 7 days prior"
- Reference_point: "receiving the first dose of study medication"
- Procedure: "radiographic"
- Observation: "objective progression"
- Temporal: "during or after"
- Reference_point: "treatment with sorafenib or oxaliplatin-based chemotherapy"
- Drug: "sorafenib"
- Drug: "oxaliplatin"
- Qualifier: "sorafenib or oxaliplatin-based"
- Procedure: "chemotherapy"
- Condition: "intolerance"
- Drug: "sorafenib"
- Drug: "oxaliplatin"
- Qualifier: "sorafenib or oxaliplatin-based"
- Procedure: "chemotherapy"
- Person: "Female"
- Condition: "childbearing potential"
- Measurement: "pregnancy test urine"
- Measurement: "serum pregnancy test"
- Temporal: "within 72 hours prior"
- Value: "negative"
- Reference_point: "receiving the first dose of study therapy"
- Post-eligibility: "Female participants of childbearing potential must have a negative urine or serum pregnancy test within 72 hours prior to receiving the first dose of study therapy"
- Procedure: "adequate contraception"
- Person: "male"
- Person: "Female"
- Grammar_Error: "and"
- Condition: "reproductive potential"
- Non-query-able: "Female and male participants of reproductive potential must agree to use adequate contraception starting from the first dose of study medication, throughout the study period, and for up to 120 days after the last dose of study medication"
- Post-eligibility: "Female and male participants of reproductive potential must agree to use adequate contraception starting from the first dose of study medication, throughout the study period, and for up to 120 days after the last dose of study medication"